2. History of allergic reactions to TGR-1202 or carfilzomib

The above is a clinical trial exclusion criterion. Annotated with entity spans:
[Parsing_Error: 2.] [Temporal: History] of [Condition: allergic reactions] to [Drug: TGR-1202] or [Drug: carfilzomib]